Aquellas desigualdades evitables, consideradas injustas en el acceso a los servicios de salud entre regiones o entre subgrupos de población en un mismo país, se corresponde con el término de:
1. Desigualdad social en salud.
2. Equidad en salud.
3. Determinantes sociales.
4. Inequidad en salud.
5. Pobreza.

Respuesta correcta: 2. Equidad en salud.